Clinical trial exclusion criterion:
Currently taking antidepressants or other psychiatric medications

Entity relations:
- OR("antidepressants", "psychiatric medications")